Clinical trial exclusion criterion:
Pre-existing use of narcotics or opioids

Entity relations:
- Has_temporal("narcotics", "Pre-existing")
- OR("narcotics", "opioids")